Patients with do-not-resuscitate (DNR) status;

The above is a clinical trial exclusion criterion. Annotated with entity spans:
Patients with [Observation: do-not-resuscitate (DNR) status];